Patient with spontaneous intracranial hemorrhage or traumatic intracranial hemorrhage or patient requiring neurological surgery

The above is a clinical trial inclusion criterion. Annotated with entity spans:
Patient with [Condition: spontaneous intracranial hemorrhage] or [Condition: traumatic intracranial hemorrhage] or patient [Mood: requiring] [Procedure: neurological surgery]